一位 43 歲婦女，G2P2，2 次皆為剖腹產，因月經異常，檢查發現巨大子宮肌瘤。接受子宮全切除，手術不順利，剝離子宮下段黏連時，膀胱三角上方表淺損傷 3 公分，馬上用可吸收羊腸線修補。術後 8 週最有可能的結果是：
A. 膀胱陰道瘻管
B. 輸尿管阻塞
C. 正常術後情況
D. 腹腔內囤積尿液

正確答案：C. 正常術後情況